長期酒癮患者易罹患「酒精誘發之精神病疾患（Alcohol-induced psychotic disorder）」，此類患者最常出現下列何種知覺障礙？
A. 視幻覺
B. 聽幻覺
C. 嗅幻覺
D. 觸幻覺

正確答案：B. 聽幻覺